BMI <35 and > 60 kg/m2

The above is a clinical trial exclusion criterion. Annotated with entity spans:
[Measurement: BMI] [Value: <35 and > 60 kg/m2]